Have diagnosed COPD stage III or IV according to GOLD criteria: a baseline post-bronchodilator Forced Expiratory Volume, measured at 1 second (FEV1) <50% of predicted normal and a baseline post- bronchodilator FEV1/Inspiratory Vital Capacity (IVC) ratio <70%.

The above is a clinical trial inclusion criterion. Annotated with entity spans:
Have diagnosed [Condition: COPD] [Value: stage III or IV] according to [Measurement: GOLD criteria]: a baseline [Temporal: post-bronchodilator] [Measurement: Forced Expiratory Volume, measured at 1 second (FEV1)] [Value: <50% of predicted normal] and a baseline [Temporal: post- bronchodilator] [Measurement: FEV1/Inspiratory Vital Capacity (IVC) ratio] [Value: <70%].